藥物（如 carbamazepine、gabapentin）治療無效的三叉神經痛患者，下列何種方法效果最快？
A. 顯微血管減壓術（microvascular decompression）
B. 三叉神經節注射甘油（glycerol injection）
C. 伽馬刀立體定位手術（gamma knife surgery）
D. 氣球壓迫術（balloon compression）

正確答案：A. 顯微血管減壓術（microvascular decompression）